hypersensitivity to selective 5-HT receptor antagonists

The above is a clinical trial exclusion criterion. Annotated with entity spans:
[Condition: hypersensitivity] to [Drug: selective 5-HT receptor antagonists]